關於妥瑞氏症（Tourette's disorder），何者錯誤？
A. 大多數在青少年後症狀會變嚴重
B. 常合併注意力缺損／過動疾患（attention-deficit/hyperactivity disorder）
C. 常合併強迫症
D. 輕度症狀不需要治療

正確答案：A. 大多數在青少年後症狀會變嚴重